History or onset neurological diseases;

The above is a clinical trial exclusion criterion. Annotated with entity spans:
[Temporal: History] or [Temporal: onset] [Condition: neurological diseases];